Clinical trial inclusion criterion:
Hepatitis B surface antigen (HBsAg) positive and <1000 IU/mL.

Entity relations:
- Subsumes("Hepatitis B surface antigen", "HBsAg")
- Has_value("Hepatitis B surface antigen", "positive")
- Has_value("Hepatitis B surface antigen", "<1000 IU/mL")